下列何種屬於非膜性胞器？
A. 核糖體（ribosome）
B. 高爾基體（Golgi apparatus）
C. 粒線體（mitochondrion）
D. 平滑性內質網（smooth endoplasmic reticulum）

正確答案：A. 核糖體（ribosome）